對於低體溫病人之處理，下列敘述何者錯誤？
A. 低體溫病人易誘發 ventricular fibrillation（VF），處理時動作應溫柔及心電圖監視
B. 體溫 30℃以下，如心臟停止，治療以內在回溫（internal rewarming）為主
C. 體溫 30℃以下，如心臟停止，心電圖如為 VF，應電擊三次，如無效，則只要做 CPR，直到體溫超過 30℃
D. 體溫 32℃，如心臟停止，急救方法與一般情形一樣，除了摸脈搏的時間要長些，用藥的間隔要久些

正確答案：C. 體溫 30℃以下，如心臟停止，心電圖如為 VF，應電擊三次，如無效，則只要做 CPR，直到體溫超過 30℃